Clinical trial inclusion criterion:
American Society of Anesthesiologists Physical Status Classification (ASA) 1-2

Entity relations:
- Subsumes("American Society of Anesthesiologists Physical Status Classification", "ASA")
- Has_value("American Society of Anesthesiologists Physical Status Classification", "1-2")